Clinical trial exclusion criterion:
Treatment with methylphenidate is contraindicated in the opinion of the study physician

Annotated entities:
- Drug: "methylphenidate"